Clinical trial exclusion criterion:
Pinhole visual acuity worse than 20/200 in the unaffected eye

Annotated entities:
- Measurement: "Pinhole visual acuity"
- Value: "worse than 20/200"